下列何者由尺側屈腕肌（flexor carpi ulnaris）的兩個頭之間穿過？
A. 橈神經（radial nerve）
B. 正中神經（median nerve）
C. 尺神經（ulnar nerve）
D. 尺動脈（ulnar artery）

正確答案：C. 尺神經（ulnar nerve）